Clinical trial exclusion criterion:
4. Patients with Magnetic resonance imaging contraindication ,including claustrophobic syndrome patients

Entity relations:
- AND("contraindication", "Magnetic resonance imaging")
- Subsumes("contraindication", "claustrophobic syndrome")